pregnant women in 30 to 32 weeks of gestation, with positive HBsAg and HBeAg,serum viral load above 8log10 copies per mL

The above is a clinical trial inclusion criterion. Annotated with entity spans:
[Condition: pregnant] [Person: women] in [Value: 30 to 32 weeks] of [Measurement: gestation], with [Value: positive] [Measurement: HBsAg] and [Measurement: HBeAg],[Measurement: serum viral load] [Value: above 8log10 copies per mL]